Clinical trial inclusion criterion:
Known history of severe hepatic impairment

Entity relations:
- Has_qualifier("hepatic impairment", "severe")